Clinical trial exclusion criterion:
Participants who are decisionally and/or cognitively impaired

Annotated entities:
- Condition: "cognitively impaired"